Clinical trial inclusion criterion:
Sepsis

Annotated entities:
- Condition: "Sepsis"